於腹腔鏡手術中，因 Pneumoperitoneum 而產生的 Complication 中，下列那一項最嚴重？
A. Pneumothorax
B. Pneumomediastinum
C. Gas embolus
D. Subcutaneous emphysema

正確答案：C. Gas embolus